Clinical trial exclusion criterion:
The patient has a known hypersensitivity or contraindication to any of the following medications: Heparin, Aspirin, Clopidogrel, Cilostazol

Annotated entities:
- Condition: "hypersensitivity"
- Condition: "contraindication"
- Drug: "Heparin"
- Drug: "Aspirin"
- Drug: "Clopidogrel"
- Drug: "Cilostazol"